Clinical trial inclusion criterion:
Qb-score 1.3 or higher on at least one of the weighted summary parameters QbActivity, QbInattention or QbImpulsivity on the QbTest.

Entity relations:
- Has_value("Qb-score", "1.3 or higher")